What percent of Rheumatoid Arthritis (RA) patients are not responding to anti-TNF therapy?

These therapies are, however, expensive and 30% of patients fail to respond.